Child or parent/LAR is an immediate relative of study staff or an employee who is supervised by study staff.

The above is a clinical trial exclusion criterion. Annotated with entity spans:
[Non-query-able: Child or parent/LAR is an immediate relative of study staff or an employee who is supervised by study staff.]